• Patients without PN during their hospitalization

The above is a clinical trial exclusion criterion. Annotated with entity spans:
• Patients [Negation: without] [Procedure: PN] [Temporal: during their hospitalization]